¿Qué análisis deben ser controlados en los tratamientos de mantenimiento con sales de litio?
1. Enzimas hepáticas.
2. Anticuerpos antinucleares.
3. Ferritina y sideremia.
4. Función tiroidea y renal.
5. Tirocalcitonina.

Respuesta correcta: 4. Función tiroidea y renal.